Active prostatitis or urinary tract infection

The above is a clinical trial exclusion criterion. Annotated with entity spans:
[Temporal: Active] [Condition: prostatitis] or [Condition: urinary tract infection]